Which G protein is essential in the formation and function of lamellipodia?

Recruitment of the small G-protein Rac1 to the plasma membrane is essential in inducing the local formation of specialized cellular processes termed lamellipodia.